Clinical trial exclusion criterion:
Person in an emergency, life threatening situation.

Entity relations:
- OR("emergency situation", "life threatening situation")